Clinical trial inclusion criterion:
At least one sign of RV pressure overload/dysfunction on CT angiography or echocardiography

Entity relations:
- Has_multiplier("sign of RV pressure overload", "At least one")
- AND("CT angiography", "sign of RV pressure overload")
- OR("sign of RV pressure overload", "sign of RV pressure dysfunction")
- OR("CT angiography", "echocardiography")